Are in renal failure (Creatinine clearance <15 mL/min), have NYHA Functional class IV heart failure, or a systemic illness likely to limit survival to <1 year

The above is a clinical trial exclusion criterion. Annotated with entity spans:
Are in [Condition: renal failure] ([Measurement: Creatinine clearance] [Value: <15 mL/min]), have [Measurement: NYHA Functional class] [Value: IV] [Condition: heart failure], or a [Condition: systemic illness] likely to limit [Observation: survival] to [Value: <1 year]